Clinical trial inclusion criterion:
Stable prednisone <10mg or equivalent

Entity relations:
- Has_value("prednisone", "<10mg")
- Has_multiplier("prednisone", "Stable")